一位 30 歲的男性因為右腳脛腓骨粉碎骨折，經過骨髓內鋼釘固定治療後發現，右踝關節、以及腳趾頭無法背屈（dorsiflexion），請問最有可能受傷的組織構造是下列何者？
A. 淺部腓神經（superficial peroneal nerve）
B. 深部腓神經（deep peroneal nerve）
C. 後脛骨神經（posterior tibial nerve）
D. 坐骨神經（sciatic nerve）

正確答案：B. 深部腓神經（deep peroneal nerve）